Clinical trial inclusion criteria:
Aged 18 years or older
Previously taken one or more statins
Withdrawn from statins because of perceived side effects
Developed side effects within 2 weeks of initiation
Clinical indication for statins for primary or secondary prevention of cardiovascular disease or dyslipidaemia, on either no medication or non-statin lipid lowering therapy (e.g, ezetimibe)

Annotated entities:
- Person: "Aged"
- Value: "18 years or older"
- Multiplier: "one or more"
- Drug: "statins"
- Non-query-able: "Withdrawn from statins because of perceived side effects"
- Condition: "side effects"
- Temporal: "within 2 weeks of initiation"
- Reference_point: "initiation"
- Condition: "indication"
- Drug: "statins"
- Observation: "prevention of cardiovascular disease"
- Qualifier: "secondary"
- Qualifier: "primary"
- Condition: "dyslipidaemia"